Clinical trial inclusion criterion:
Has undergone first time isolated CABG due to an episode of acute coronary syndrome (STEMI, NSTEMI, unstable angina) within 6 weeks before surgery

Annotated entities:
- Procedure: "isolated CABG"
- Condition: "acute coronary syndrome"
- Condition: "STEMI"
- Condition: "NSTEMI"
- Condition: "unstable angina"
- Temporal: "within 6 weeks before surgery"
- Reference_point: "surgery"
- Multiplier: "first time"